下列那一個方法可用來估計蛋白質分子量？
A. 凝膠層析（gel filtration chromatography）
B. 等電聚焦（isoelectric focusing）
C. 親合層析（affinity chromatography）
D. 自然膠電泳（native gel electrophoresis）

正確答案：A. 凝膠層析（gel filtration chromatography）